一位 26 歲病人被診斷為急性淋巴芽細胞白血病，其費城染色體陽性。經過誘導（induction）化學治療達到完全緩解。此時最理想的治療方式為：
A. 尋找 HLA 相合之捐贈者，並準備做異體造血幹細胞移植
B. 繼續鞏固及加強性化學治療，接著再進行維持性化學治療
C. 可改用口服酪氨酸激酶抑制劑 imatinib 做維持性治療
D. 可停止治療，但需繼續追蹤

正確答案：A. 尋找 HLA 相合之捐贈者，並準備做異體造血幹細胞移植